Clinical trial exclusion criterion:
Allergy to any protocol medication

Annotated entities:
- Condition: "Allergy"